Clinical trial exclusion criterion:
Patients having had an ophthalmic surgical procedure within 6 months of the beginning of the study.

Entity relations:
- Has_temporal("ophthalmic surgical procedure", "within 6 months of the beginning of the study")
- Has_index("within 6 months of the beginning of the study", "study")